Clinical trial inclusion criterion:
Aged 18-80 years.

Entity relations:
- Has_value("Aged", "18-80 years")